Clinical trial inclusion criterion:
Patient or physician refusal to enroll in the study

Annotated entities:
- Post-eligibility: "Patient or physician refusal to enroll in the study"